Clinical trial inclusion criterion:
Eastern Cooperative Oncology Group (ECOG) 0 or 1

Entity relations:
- Has_value("Eastern Cooperative Oncology Group (ECOG)", "0 or 1")